Para detectar pequeñas deleciones o duplicaciones a nivel genómico, la técnica de elección será:
1. Cariotipo de bandas G.
2. Array CGH.
3. Microarrays de expresión.
4. PCR.

Respuesta correcta: 2. Array CGH.